Clinical trial inclusion criterion:
body mass index (BMI) between 19 to 30 kg/m2 and body weight between 50 to 100 kg inclusive

Annotated entities:
- Measurement: "body mass index (BMI)"
- Value: "between 19 to 30 kg/m2"
- Measurement: "body weight"
- Value: "50 to 100 kg inclusive"